Clinical trial exclusion criterion:
Need for a double kidney transplantation.

Entity relations:
- Has_mood("double kidney transplantation", "Need for")